Clinical trial inclusion criterion:
On stable anti-parkinsonian therapy for 2 weeks before enrollment

Annotated entities:
- Qualifier: "stable"
- Procedure: "anti-parkinsonian therapy"
- Multiplier: "for 2 weeks"
- Temporal: "before enrollment"